Clinical trial exclusion criterion:
Severe asthma exacerbation requiring resuscitation

Entity relations:
- AND("asthma exacerbation", "resuscitation")
- Has_qualifier("asthma exacerbation", "Severe")